¿Cuál es la posición de las fibras intrafusales del huso muscular respecto al músculo homónimo?:
1. En serie con las fibras extrafusales.
2. En el tendón que une ese músculo al hueso.
3. Formando una red de fibras sensitivas.
4. En paralelo a las fibras extrafusales.

Respuesta correcta: 4. En paralelo a las fibras extrafusales.